Clinical trial inclusion criterion:
Age > 18 years

Annotated entities:
- Person: "Age"
- Value: "> 18 years"